Clinical trial exclusion criterion:
Patients with clinically significant ventricular tachycardia, atrial fibrillation, atrial flutter or other clinically significant arrhythmia at the discretion of the investigator

Entity relations:
- Has_qualifier("arrhythmia", "clinically significant")
- Has_qualifier("ventricular tachycardia", "clinically significant")
- OR("ventricular tachycardia", "atrial flutter", "atrial fibrillation")
- OR("ventricular tachycardia", "arrhythmia")